Clinical trial exclusion criterion:
Current diagnosis of heart failure (New York Heart Association (NYHA) Class II-IV)

Entity relations:
- Has_value("New York Heart Association (NYHA) Class", "II-IV")
- AND("heart failure", "New York Heart Association (NYHA) Class")